Clinical trial inclusion criterion:
Oral body temperature within the range 35.0-37.5 °C

Entity relations:
- Has_value("Oral body temperature", "35.0-37.5 °C")